Serious chronic disease including any medically significant chronic pulmonary, cardiovascular, renal, neurological, psychiatric or metabolic disorder, as determined by medical history and physical examination.

The above is a clinical trial exclusion criterion. Annotated with entity spans:
[Qualifier: Serious] [Condition: chronic disease] including any medically significant [Condition: chronic pulmonary], cardiovascular, renal, neurological, psychiatric or metabolic disorder, as determined by medical history and physical examination.